Subjects must be female

The above is a clinical trial inclusion criterion. Annotated with entity spans:
Subjects must be [Person: female]